Clinical trial exclusion criterion:
Infection with hepatitis C Virus

Annotated entities:
- Qualifier: "hepatitis C Virus"
- Condition: "Infection"